Clinical trial exclusion criterion:
Placement of an intrauterine device (IUD) or intrauterine system (IUS)

Annotated entities:
- Device: "intrauterine device"
- Device: "IUD"
- Device: "intrauterine system"
- Device: "IUS"